Clinical trial inclusion criterion:
Scheduled 1 or 2-level ACDF spine surgery

Entity relations:
- Has_qualifier("ACDF spine surgery", "1 -level")
- OR("1 -level", "2-level")